Clinical trial inclusion criterion:
Parturients presented for Cesarean section

Annotated entities:
- Condition: "Parturients"
- Measurement: "Cesarean section"